ability to use verbal or pictorial pain assessment tools and techniques

The above is a clinical trial inclusion criterion. Annotated with entity spans:
[Condition: ability] to use [Procedure: verbal] or [Procedure: pictorial pain assessment tools and techniques]